下列何者是造成傷口攣縮（wound contracture）的主要細胞？
A. T-淋巴球（T-lymphocyte）
B. B-淋巴球（B-lymphocyte）
C. 巨噬細胞（macrophage）
D. 肌纖維母細胞（myofibroblast）

正確答案：D. 肌纖維母細胞（myofibroblast）